La varianza de un conjunto de n resultados experimentales repetidos se define cómo:
1. La desviación estándar elevada al cuadrado y dividida por n.
2. La desviación estándar elevada al cuadrado y dividida por n-1.
3. La desviación estándar elevada al cuadrado.
4. La desviación estándar elevada al cuadrado y dividida por n-2.

Respuesta correcta: 3. La desviación estándar elevada al cuadrado.